Clinical trial exclusion criterion:
Knowingly affected by HIV or Hepatitis.

Entity relations:
- OR("HIV", "Hepatitis")